Experience with pump-assisted infusions of IgPro20 at the tolerated flow rate of 25 mL/h per injection site for at least 1 month prior to Day 1.

The above is a clinical trial inclusion criterion. Annotated with entity spans:
Experience with [Qualifier: pump-assisted infusions] of [Drug: IgPro20] at the [Qualifier: tolerated] [Multiplier: flow rate of 25 mL/h per injection site] [Temporal: for at least 1 month prior to Day 1].